Chest radiograph showing new opacities.

The above is a clinical trial inclusion criterion. Annotated with entity spans:
[Procedure: Chest radiograph] showing [Qualifier: new] [Condition: opacities].